current or former smoker with an accumulated consumption >10 packs x year

The above is a clinical trial inclusion criterion. Annotated with entity spans:
current or former [Person: smoker] with an accumulated [Observation: consumption] [Multiplier: >10 packs x year]